Clinical trial inclusion criterion:
women

Annotated entities:
- Person: "women"